鼠蹊部疝氣修補術後併發症非常罕見，一定需再度手術處理者為何？
A. 陰囊術後腫脹，睪丸萎縮
B. 陰囊水腫（hydrocele）
C. 陰囊內有大量血腫
D. 傷口感染

正確答案：C. 陰囊內有大量血腫